Clinical trial exclusion criterion:
Patients with head trauma or Neurosurgical intervention

Annotated entities:
- Condition: "head trauma"
- Procedure: "Neurosurgical intervention"